Clinical trial inclusion criterion:
Phase I: Patients must have histologically confirmed R/R NHL or HL (defined by WHO criteria). Patients with chronic lymphocytic leukemia (CLL) and small lymphocytic lymphoma (SLL) are eligible. In addition, patients with NHL other than diffuse large B cell lymphomas (DLBCL) must have received at least 2 prior therapies. Patients with DLBCL and HL will be eligible if there is no available standard therapy.

Entity relations:
- Has_value("histologically", "confirmed")
- Has_qualifier("NHL", "R/R")
- AND("R/R", "WHO criteria")
- Subsumes("confirmed", "WHO criteria")
- Has_negation("diffuse large B cell lymphomas (DLBCL)", "other than")
- Has_temporal("therapies", "prior")
- Has_multiplier("therapies", "at least 2")
- AND("NHL", "therapies")
- Has_negation("standard therapy", "no")
- AND("DLBCL", "standard therapy")
- AND("NHL", "histologically")
- AND("diffuse large B cell lymphomas (DLBCL)", "therapies")
- AND("and", "standard therapy")
- OR("chronic lymphocytic leukemia (CLL)", "small lymphocytic lymphoma (SLL)")
- OR("DLBCL", "HL")
- OR("NHL", "HL")